Clinical trial exclusion criterion:
Oral anticoagulation with International Normalized Ratio (INR) > 2

Annotated entities:
- Procedure: "Oral anticoagulation"
- Measurement: "International Normalized Ratio (INR)"
- Value: "> 2"